一位中年男性，長期腹瀉且背部及四肢反覆出現對稱性、蕁　疹樣之劇癢丘疹及細小水疱，口腔黏膜正常，最可能之診斷為：
A. Pemphigus vulgaris
B. Pemphigus foliaceus
C. Bullous pemphigoid
D. Dermatitis herpetiformis

正確答案：D. Dermatitis herpetiformis